allergic history to dexmedetomidine

The above is a clinical trial exclusion criterion. Annotated with entity spans:
[Condition: allergic] [Temporal: history] to [Drug: dexmedetomidine]